下列有關良性前列腺肥大接受經尿道前列腺切除手術治療，產生TUR syndrome的敘述，何者錯誤？
A. 病人會有nausea、vomiting、confusion、 hypertension、bradycardia、visual disturbance等症狀
B. 主要是因手術時間太久，病人吸收太多之hypotonic irrigation solution所致
C. 治療方法是應立即停止手術，給予病人利尿劑、normal saline或 hypertonic saline
D. TUR syndrome發生時，病人正處於hypervolemic及hypernatremic狀態

正確答案：D. TUR syndrome發生時，病人正處於hypervolemic及hypernatremic狀態